Currently smoke at least ten cigarettes a day

The above is a clinical trial inclusion criterion. Annotated with entity spans:
Currently [Observation: smoke] [Multiplier: at least ten cigarettes a day]